Liver imaging within 6 months of Baseline/Day 1 to exclude hepatocellular carcinoma HCC) is required

The above is a clinical trial inclusion criterion. Annotated with entity spans:
[Procedure: Liver imaging] [Temporal: within 6 months of Baseline/Day 1] to [Negation: exclude] [Condition: hepatocellular carcinoma HCC)] is required